停經後婦女骨質疏鬆的危險因子，不包括下列何者？
A. 體型嬌小
B. 家族史
C. 停經年齡較晚
D. 長期服用類固醇

正確答案：C. 停經年齡較晚